Clinical trial exclusion criterion:
platelet count <50,000/ µL

Annotated entities:
- Measurement: "platelet count"
- Value: "<50,000/ µL"